Clinical trial inclusion criterion:
Available to participate for the study duration, including all planned follow-up visits for up to 9 months from screening.

Annotated entities:
- Post-eligibility: "Available to participate for the study duration, including all planned follow-up visits for up to 9 months from screening."